Clinical trial exclusion criterion:
Subjects who can not stop treatment with topical steroids (group 1~5), oral antibiotics, whole body photochemotherapy, immunosuppressive drug within 4 weeks before the treatment visit

Annotated entities:
- Non-query-able: "can not stop"
- Drug: "topical steroids"
- Context_Error: "group 1~5"
- Drug: "oral antibiotics"
- Procedure: "whole body photochemotherapy"
- Drug: "immunosuppressive drug"
- Temporal: "within 4 weeks before"
- Reference_point: "treatment visit"